52歲男性，罹患轉移性腎細胞癌，主訴從臀部往下到左小腿之疼痛已數天。他描述疼痛性質是尖銳如刀刺、有灼熱感，疼痛分數可達7/10。下列何者是處理此病人疼痛最適當之藥物？
A. gabapentin
B. codeine
C. meperidine
D. 非類固醇類抗發炎藥（NSAID）

正確答案：A. gabapentin